Current hormone replacement therapy;

The above is a clinical trial exclusion criterion. Annotated with entity spans:
[Temporal: Current] [Procedure: hormone replacement therapy];